Clinical trial exclusion criterion:
Invasive hepatocellular carcinoma without any isolated tumor

Annotated entities:
- Condition: "hepatocellular carcinoma"
- Qualifier: "Invasive"
- Condition: "isolated tumor"
- Negation: "without"